Second trimester pregnancy.

The above is a clinical trial inclusion criterion. Annotated with entity spans:
[Qualifier: Second trimester] [Condition: pregnancy].